下列何種抗凝血藥物主要是經由肝臟代謝？
A. Argatroban
B. Enoxaparin
C. Fondaparinux
D. Lepirudin

正確答案：A. Argatroban